Patients with clinically significant mental health issues such as psychosis requiring treatment with antipsychotic medications.

The above is a clinical trial exclusion criterion. Annotated with entity spans:
Patients with [Qualifier: clinically significant] [Condition: mental health issues] such as [Condition: psychosis] requiring [Procedure: treatment] with [Drug: antipsychotic medications].